一位兩個月大嬰兒至門診接受預防注射，在理學檢查時發現嬰兒頭部向右側看且往左側傾斜，左頸部可摸到明顯硬塊，經進一步診斷為斜頸。關於此嬰兒的敘述，何者錯誤？
A. 可與先天性髖關節脫臼（congenital dysplasia of the hip）同時發生
B. 常因左側胸鎖乳突肌（sternocleidomastoid muscle）之異常所致
C. 可能造成左側臉部扁平及左側枕部扁平
D. 三歲以前徹底治療，臉部畸形大都可改善

正確答案：C. 可能造成左側臉部扁平及左側枕部扁平